Clinical trial exclusion criterion:
Mental Retardation or Autistic Spectrum Disorder

Annotated entities:
- Condition: "Mental Retardation"
- Condition: "Autistic Spectrum Disorder"